List Cdk targets that are dephosphorylated during cytokinesis

The final event of the eukaryotic cell cycle is cytokinesis, when two new daughter cells are born. How the timing and execution of cytokinesis is controlled is poorly understood. A phosphoproteome analysis has identified Aip1, Ede1 and Inn1 as cytokinetic regulators. It seems that cytokinesis is coordinately controlled by the master cell cycle regulator Cdk together with its counteracting phosphatase and that it is executed by concerted dephosphorylation of Cdk targets involved in several cell biological processes.